On what chromosome is the gene for "SILVER" coat color found for the domestic cat?

the gene for "silver" coat color found for the domestic cat is located on chromosome d2.